Patients who are delirious on initial assessment by ED physician or severe dementia

The above is a clinical trial exclusion criterion. Annotated with entity spans:
Patients who are [Condition: delirious] [Temporal: on initial assessment] by ED physician or [Qualifier: severe] [Condition: dementia]